¿Cuál de las siguientes estructura pertenece al hueso cúbito?:
1. Epicóndilo lateral.
2. Olécranon.
3. Fosa olecraniana.
4. Tubérculo mayor.

Respuesta correcta: 2. Olécranon.